Clinical trial inclusion criterion:
measurable cutaneous or visceral metastasis

Entity relations:
- Has_qualifier("cutaneous metastasis", "measurable")
- OR("cutaneous metastasis", "visceral metastasis")